La célula se destruye para liberar la secreción:
1. Merocrina.
2. Apocrina.
3. Endocrina.
4. Holocrina.
5. Paracrina.

Respuesta correcta: 4. Holocrina.